Clinical trial inclusion criterion:
Age 22 or above

Entity relations:
- Has_value("Age", "22 or above")